Previously treated or incurable disease without options for standard of care therapy

The above is a clinical trial inclusion criterion. Annotated with entity spans:
[Context_Error: Previously treated or incurable disease without options for standard of care therapy]